Clinical trial exclusion criterion:
Patients with severe emphysema, pulmonary vasculitis, or a history of pulmonary emboli.

Entity relations:
- Has_qualifier("emphysema", "severe")
- OR("emphysema", "pulmonary vasculitis", "pulmonary emboli")